下列有關原發性心臟內腫瘤之敘述，何者錯誤？
A. 原發性心臟內腫瘤約25%為良性，約75%為惡性
B. 成人最常見原發性良性心臟內腫瘤為myxoma
C. 15歲以下孩童最常見原發性良性心臟內腫瘤為rhabdomyoma
D. 即便是原發性良性心臟內腫瘤，一旦有心衰竭、栓塞症狀及感染心內膜炎，便要考慮手術治療

正確答案：A. 原發性心臟內腫瘤約25%為良性，約75%為惡性